Clinical trial inclusion criterion:
naive to HCV treatment,

Entity relations:
- Has_negation("HCV treatment", "naive")